6. Presence of abnormal physical finding on the vulva, vaginal walls or cervix during pelvic/speculum examination and/or colposcopy

The above is a clinical trial exclusion criterion. Annotated with entity spans:
6. Presence of [Condition: abnormal physical finding on the vulva], vaginal walls or cervix during [Procedure: pelvic]/[Procedure: speculum examination] and/or [Procedure: colposcopy]